Clinical trial inclusion criterion:
No significant abnormalities in ECG per investigator judgment.

Annotated entities:
- Procedure: "ECG"
- Condition: "abnormalities in ECG"
- Qualifier: "significant"
- Negation: "No"
- Subjective_judgement: "No significant abnormalities in ECG per investigator judgment."